What is the function of the NIPBL factor in genome conformation?

The Cohesin loading factor NIPBL recruits histone deacetylases to mediate local chromatin modifications.